Refusal of village chief

The above is a clinical trial exclusion criterion. Annotated with entity spans:
[Non-query-able: Refusal of village chief]